Men or non-pregnant women of any ethnic background between the age of 18 and 45 years old

The above is a clinical trial inclusion criterion. Annotated with entity spans:
[Person: Men] or [Qualifier: non-pregnant] [Person: women] of any ethnic background between the [Person: age] of [Value: 18 and 45 years old]